以下疾病或藥物相關之腎病症候群，何者之病理變化常不是膜性腎病變（membranous glomerulopathy）？
A. B 型肝炎感染（帶原）
B. 先天性梅毒（syphilis）
C. 霍杰金氏淋巴瘤（Hodgkin lymphoma）
D. 使用 penicillamine 藥物

正確答案：C. 霍杰金氏淋巴瘤（Hodgkin lymphoma）